一名 7 歲女童來門診求診，家人主訴慢性咳嗽已有半年，同時有夜咳情形（一個月 3 次），日間症狀大約一週 3 次。理學檢查可見黑眼圈，聽診發現雙側輕微呼氣末期喘鳴聲（end expiratory wheezing），進一步檢查發現對塵嚴重過敏，且 Total IgE 為 250 IU/L，FEV1 為預測值的 85%。有關此病人的治療原則，下列敘述何者正確？
A. 根據 National Asthma Education and Prevention Program（NAEPP）guideline，此病人的嚴重度屬於 moderate persistent
B. 可使用高劑量吸入劑型類固醇加吸入劑型長效型乙二型支氣管擴張劑（LABA）治療
C. 若氣喘急性發作，可使用口服或是靜脈注射類固醇來治療
D. 控制居家環境，減少塵的暴露，不會改善氣喘控制的好壞

正確答案：C. 若氣喘急性發作，可使用口服或是靜脈注射類固醇來治療